Una joven de 24 años sufre una caída de la bicicleta con traumatismo en la zona abdominal con el manillar. A las pocas horas del traumatismo comienza con dolor intenso en hipocondrio izquierdo por lo que acude a consultar a un servicio de urgencias. A su llegada el paciente se encuentra pálida y sudorosa, las cifras de presión arterial son 82/54 mmHg y la frecuencia cardiaca es de 120 latidos por minuto. ¿Que tipo de shock es el que más probablemente padece esta paciente?
1. Hipovolémico.
2. Séptico.
3. Cardiogénico.
4. Anafiláctico.
5. Neurogénico.

Respuesta correcta: 1. Hipovolémico.